青年型皮肌炎（juvenile dermatomyositis）的敘述，下列何者錯誤？
A. 可以amyopathic dermatomyositis表現
B. 易合併皮膚鈣化症（calcinosis cutis）
C. 易併發皮膚血管病變（vasculopathy）
D. 易併發鼻咽癌

正確答案：D. 易併發鼻咽癌